下列何種病原最少引起溶血性尿毒症候群（hemolytic-uremic syndrome）？
A. 大腸桿菌O157:H7（E. coli O157:H7）
B. 志賀氏菌（Shigella）
C. 肺炎鏈球菌（Streptococcus pneumoniae）
D. 霍亂弧菌（Vibrio cholerae）

正確答案：D. 霍亂弧菌（Vibrio cholerae）